Clinical trial exclusion criterion:
Subject is incarcerated.

Annotated entities:
- Observation: "incarcerated"